St.p. cervical tear

The above is a clinical trial exclusion criterion. Annotated with entity spans:
[Condition: St.p.] [Procedure: cervical tear]